17歲男性，早上起床時覺得肚臍周圍悶悶的不舒服，整天食慾不振，到了晚上腹痛轉移到右下腹，有輕微發燒到 38.3度，理學檢查顯示局部右下疼痛，沒有反彈痛，則這個男孩最可能的診斷是？
A. 大腸癌破裂
B. 急性闌尾炎
C. 急性憩室炎
D. 腸	疊

正確答案：B. 急性闌尾炎